Receipt of chemotherapy for prostate or other cancer within the past 12 months with residual cognitive deficits, or receipt of chemotherapy for mCRPC. Patients/physicians planning treatment with chemotherapy during the 12 month period of the investigation are also ineligible.

The above is a clinical trial exclusion criterion. Annotated with entity spans:
Receipt of [Procedure: chemotherapy] for [Condition: prostate] or [Qualifier: other] [Condition: cancer] [Temporal: within the past 12 months] with [Condition: residual cognitive deficits], or receipt of [Procedure: chemotherapy] for [Condition: mCRPC]. [Non-representable: Patients/physicians planning treatment with chemotherapy during the 12 month period of the investigation are also ineligible.]